dementia

The above is a clinical trial exclusion criterion. Annotated with entity spans:
[Condition: dementia]